一位 40 歲女性，突發頭痛、暈眩至急診，腦部磁振造影顯示有右側延腦外側梗塞（right lateral medullary infarction），病人會有下列那些症狀表現？①右側肢體的痛感下降 ②右側臉的痛感下降 ③右側肢體失調（dysmetria） ④右側肢體無力
A. ①③
B. ②④
C. ①④
D. ②③

正確答案：D. ②③